Clinical trial exclusion criterion:
supplemental oxygen requirement (< 3 months)

Entity relations:
- Has_mood("supplemental oxygen", "requirement")
- Has_temporal("supplemental oxygen", "< 3 months")